一個 58 歲 B 型肝炎帶原的男性病患，在一年半前因升結腸癌（Dukes' stage：B2）接受根治性右半側大腸切除術治療，術後在門診的定期追蹤包括胸部 X 光、腹部超音波及大腸鏡檢查等顯示一切皆正常。但最近一週前的腹部超音波檢查卻發現在肝臟左葉的 lateral segment 之中央處有一個兩公分大小的 isoechoic tumor shadow，血清 CEA 值仍正常，病人並無症狀。腹部電腦斷層掃描在同一位置也顯現有同樣大小的一個 lesion。其他部位的腹部超音波和電腦斷層掃描檢查之結果皆屬正常。PET（正子斷層掃描）檢查的結果，在左葉肝也出現和前兩項檢查一致的異常顯影，此外並未有其他異常顯影之處。則這位病人的診斷可能是什麼？
A. Liver abscess
B. Metastatic colon cancer to liver
C. Hepatocellular carcinoma
D. Metastatic colon cancer to liver 或是 Hepatocellular carcinoma 都有可能

正確答案：D. Metastatic colon cancer to liver 或是 Hepatocellular carcinoma 都有可能